Inability to obtain informed consent from patient or next of kin

The above is a clinical trial exclusion criterion. Annotated with entity spans:
[Informed_consent: Inability to obtain informed consent from patient or next of kin]